¿Cuál de los siguientes nematodos es parásito del intestino grueso?
1. Trichuris trichiura.
2. Ancylostoma duodenale.
3. Trichinella spiralis.
4. Necator americanus.
5. Ascaris lumbricoides.

Respuesta correcta: 1. Trichuris trichiura.